Clinical trial inclusion criterion:
Target lesion length =150 mm by angiographic estimation

Annotated entities:
- Condition: "Target lesion"
- Measurement: "length"
- Value: "=150 mm"
- Procedure: "angiographic"